Clinical trial exclusion criterion:
History of receiving any antibiotics within prior 3 months,

Entity relations:
- Has_temporal("antibiotics", "within prior 3 months")
- AND("History", "antibiotics")